El ion arenio es un intermedio de reacción que se forma en las reacciones de:
1. Adición electrofílica.
2. Sustitución electrofílica aromática.
3. Sustitución nucleofílica.
4. Adición nucleofílica.
5. Sustitución nucleofílica aromática.

Respuesta correcta: 2. Sustitución electrofílica aromática.